use of immunosuppressive drugs, corticosteroids or anorexigen

The above is a clinical trial exclusion criterion. Annotated with entity spans:
use of [Drug: immunosuppressive drugs], [Drug: corticosteroids] or [Drug: anorexigen]